Clinical trial exclusion criterion:
Hemoglobin < 10 g/l and/or leucocytes < 4000 cels/mm3 and/or platelets < 150.000 cels/mm3;

Entity relations:
- Has_value("Hemoglobin", "< 10 g/l")
- Has_value("leucocytes", "< 4000 cels/mm3")
- Has_value("platelets", "< 150.000 cels/mm3")
- OR("Hemoglobin", "leucocytes", "platelets")